Clinical trial exclusion criterion:
Hematocrit (Hct) > 50%

Entity relations:
- Has_value("Hematocrit (Hct)", "> 50%")